Clinical trial exclusion criterion:
Known HIV positivity

Annotated entities:
- Condition: "HIV positivity"